下列有關念珠菌的敘述，何者錯誤？
A. 女性生殖道的正常菌叢
B. 會形成假菌絲
C. 會造成伺機性感染
D. 不會造成全身性感染

正確答案：D. 不會造成全身性感染